Clinical trial exclusion criterion:
GCS less than 15

Entity relations:
- Has_value("GCS", "less than 15")